下列何項神經不屬於頸神經叢（cervical plexus）？
A. 枕大神經
B. 枕小神經
C. 耳大神經
D. 頸橫神經

正確答案：A. 枕大神經